Allergy to acetazolamide and other sulfonamides.

The above is a clinical trial exclusion criterion. Annotated with entity spans:
[Condition: Allergy] to [Drug: acetazolamide] and [Qualifier: other] [Drug: sulfonamides].